Clinical trial exclusion criterion:
Is known to be infected with human immunodeficiency virus (HIV) or seropositive for hepatitis C virus (HCV)

Entity relations:
- OR("human immunodeficiency virus (HIV)", "seropositive for hepatitis C virus (HCV)")